Milk Protein Allergy: History of severe milk protein allergy.

The above is a clinical trial exclusion criterion. Annotated with entity spans:
[Condition: Milk Protein Allergy]: History of [Qualifier: severe] [Condition: milk protein allergy].